Clinical trial exclusion criterion:
5. Bosentan

Annotated entities:
- Parsing_Error: "5."
- Drug: "Bosentan"